前列腺管（prostatic duct）開口於下列何處？
A. 前列腺竇（prostatic sinus）
B. 尿道脊（urethral crest）
C. 膜性尿道（membranous urethra）
D. 精阜（seminal colliculus）

正確答案：A. 前列腺竇（prostatic sinus）